La recombinación somática para la generación de diversidad en linfocitos B ocurre en:
1. Médula ósea.
2. Ganglio.
3. Sangre periférica.
4. Timo.
5. Bazo.

Respuesta correcta: 1. Médula ósea.